Clinical trial exclusion criterion:
BMI more than 30

Entity relations:
- Has_value("BMI", "more than 30")